= 50 years old.

The above is a clinical trial inclusion criterion. Annotated with entity spans:
[Value: = 50 years] [Person: old].